Clinical trial inclusion criterion:
Location of distal biliary obstruction is such that it would allow the proximal end of a stent to be positioned at least 2cm from the hilum

Entity relations:
- Has_qualifier("stent", "at least 2cm from the hilum")
- Has_mood("stent", "would allow")